Clinical trial inclusion criterion:
Having previously undergone BTI. The last injection must have been performed at least 4 months prior to inclusion.

Entity relations:
- Has_temporal("injection", "at least 4 months prior to inclusion")
- Has_index("at least 4 months prior to inclusion", "inclusion")